一位 69 歲有心肌梗塞病史的男性病患，施行全身麻醉做攝護腺肥大之經尿道攝護腺切除手術（TURP），手術 90 分鐘過程順利。當病患被送至恢復室時，氣管內管已拔除，意識清醒。但 20 分鐘後病人呈現躁動、發抖、血壓 80/50 毫米汞柱、呼吸 40 次/分、心率 140 次/分、血氧飽和濃度 92%。請問以下診斷何者最不可能？
A. 術後持續出血
B. TURP 症候群
C. 心肌梗塞或缺血
D. 單純術後傷口疼痛

正確答案：D. 單純術後傷口疼痛